Clinical trial exclusion criterion:
Malignant neoplasm requiring chemotherapy, surgery, radiation or palliative therapy in the previous 5 years. Patients with intraepithelial squamous cell carcinoma of the skin treated with topical 5FU and subjects with basal cell skin cancer are allowed to enter the trial.

Entity relations:
- AND("Malignant neoplasm", "chemotherapy")
- Has_temporal("Malignant neoplasm", "previous 5 years.")
- Has_qualifier("intraepithelial squamous cell carcinoma", "skin")
- AND("intraepithelial squamous cell carcinoma", "topical 5FU")
- Has_negation("intraepithelial squamous cell carcinoma", "allowed")
- OR("chemotherapy", "surgery", "radiation", "palliative therapy")
- OR("intraepithelial squamous cell carcinoma", "basal cell skin cancer")